Which chromosome contains the TLR7 locus in the human genome?

The TLR7 locus acts on the X chromosome in humans and is located on chromosome 9 (XC7)